Clinical trial exclusion criterion:
Any surgical or medical condition which might significantly alter the absorption, distribution, metabolism, or excretion of study drugs including, but not limited to, any of the following:

Annotated entities:
- Condition: "surgical condition"
- Condition: "medical condition"
- Qualifier: "alter the absorption, distribution, metabolism, or excretion of study drugs"